下列有關腹部手術後造成小腸粘黏與阻塞之敘述，何者錯誤？
A. 鼻胃管減壓及禁食和補充體液及電解質是有需要的
B. 有時需安排多次腹部 X 光攝影檢查
C. 上消化道鋇劑攝影是必須的，以確定阻塞位置
D. 有小腸缺血現象時，宜手術處理

正確答案：C. 上消化道鋇劑攝影是必須的，以確定阻塞位置